Clinical trial inclusion criterion:
No prior uterine scar

Entity relations:
- Has_negation("uterine scar", "No")